What indication has FTY720 been approved for by the FDA?

FTY720 has been pproved (September 2010) by the U.S. FDA as a new treatment for multiple sclerosis (MS).